Es avascular el tejido:
1. Cartilaginoso.
2. Adiposo.
3. Óseo.
4. Muscular.
5. Nervioso.

Respuesta correcta: 1. Cartilaginoso.